臨床上用於治療 Raynaud's disease 之血管舒張劑，何者之作用機轉是抑制α1-adrenergic receptor？
A. Hydralazine
B. Prazosin
C. Minoxidil
D. Sildenafil

正確答案：B. Prazosin